Entre los equipos utilizados para el mezclado de polvos se encuentran los mezcladores rotatorios, los cuales se utilizan habitualmente cuando el polvo:
1. Posee flujo deficiente.
2. Fluye libremente.
3. Tiene un ángulo de reposo > 90º.
4. Es de alta intensidad.
5. Contiene humedad.

Respuesta correcta: 2. Fluye libremente.